Clinical trial inclusion criterion:
14. Females of childbearing potential must have a negative pregnancy test (urine β-hCG).

Annotated entities:
- Measurement: "pregnancy test"
- Value: "negative"
- Procedure: "urine β-hCG"
- Person: "Females"
- Condition: "childbearing potential"
- Pregnancy_considerations: "Females of childbearing potential must have a negative pregnancy test (urine β-hCG)."